La dieta basal, normal o regular, se caracteriza por:
1. Estar planificada por hostelería.
2. Ser el menú básico de los pacientes jóvenes.
3. Ser siempre con sal.
4. Proporcionar alrededor de 2200 kcal/día.
5. Ser individualizada.

Respuesta correcta: 4. Proporcionar alrededor de 2200 kcal/día.